Clinical trial inclusion criterion:
Heart rate >110 beats/min

Entity relations:
- Has_value("Heart rate", ">110 beats/min")